Clinical trial inclusion criterion:
Age 35-70 years old

Annotated entities:
- Person: "Age"
- Value: "35-70 years old"